Clinical trial inclusion criterion:
Individuals of both sexes from 18 years with a diagnosis of community-acquired pneumonia, COPD or Bronchial Asthma;

Entity relations:
- Has_value("from 18 years", "from 18 years")
- OR("community-acquired pneumonia", "COPD", "Bronchial Asthma")